Clinical trial exclusion criterion:
Hypersensitivity to B-lactams

Annotated entities:
- Drug: "B-lactams"
- Condition: "Hypersensitivity"